Which X chromosome abnormalities present lupus-like symptoms?

Tlr7 and Y chromosome abnormalities present lupus-like symptoms with considerable phenotypic overlap.